Clinical trial exclusion criterion:
Have other medical implants that may interact with MRI, e.g. abandoned implantable cardioverter defibrillator (ICD) leads or pacemaker leads other than MRI conditional, lead extensions, other active medical devices, non-MRI compatible devices, mechanical valve

Entity relations:
- AND("medical implants", "interact with MRI")
- Has_qualifier("active medical devices", "other")
- Has_negation("MRI conditional", "other than")
- AND("pacemaker leads", "MRI conditional")
- Subsumes("medical implants", "abandoned implantable cardioverter defibrillator (ICD) leads")
- OR("abandoned implantable cardioverter defibrillator (ICD) leads", "lead extensions", "active medical devices", "non-MRI compatible devices", "mechanical valve", "pacemaker leads")